The patient was on nonsteroid anti-inflammatory drug (NSAID) treatment on the day when consent was obtained, and requires the long-term continuous treatment even after treatment with the investigational drug is started.

The above is a clinical trial inclusion criterion. Annotated with entity spans:
The patient was on [Drug: nonsteroid anti-inflammatory drug (NSAID)] treatment [Temporal: on the day when consent was obtained], and requires the long-term continuous treatment even after treatment with the investigational drug is started.